Clinical trial exclusion criterion:
Subjects with taking any medication affecting level of LDL (Fenofibrate, Omega 3 fatty aicd etc.)

Entity relations:
- AND("affecting", "LDL")
- AND("medication", "affecting")
- Subsumes("medication", "Fenofibrate")
- OR("Fenofibrate", "Omega 3 fatty aicd")